一位 54 歲女性發現小腸有一 6 公分的腫瘤，經切片發現為肉瘤，免疫化學染色檢查發現 c-kit（CD117）  (+)，CD34(+)，smooth muscle actin(-)，則下列何者是最可能的診斷？
A. 平滑肌肉瘤
B. 血管肉瘤
C. 神經纖維肉瘤
D. 胃腸道基質瘤

正確答案：D. 胃腸道基質瘤